一位 38 歲的女性主訴兩年來時常會在下午開始發高燒（最高達 39.4℃），有時會伴隨喉嚨痛、關節痛及鮭魚色的皮疹發生，發燒通常只歷數小時而後自動退燒，這種發作有時會持續二個月之久，不發作時則與常人無異，本次住院的理學檢查發現有肝、脾腫大，抽血檢查發現 WBC 12800/μL，ESR  42 mm/1h，CRP 2.48 mg/L，AST 42 U/L，ALT 48 U/L，ferritin 11280 ng/mL，ANA 及類風濕因子（rheumatoid  factors）均為陰性，血液及尿液的三套培養包括細菌及黴菌均無，又常見的病毒抗體均在正常範圍內，則最可能的診斷為何？
A. Dengue fever
B. Adult-onset Still's disease
C. Plasmodium falciparum infestation
D. Cancer fever

正確答案：B. Adult-onset Still's disease